下列敘述何者不是 Darier disease 的特色？
A. 好發於 seborrheic area，如頭皮、臉、上身等處
B. 是一種 autosomal dominant 的遺傳
C. 病灶呈棕色斑塊或丘疹
D. 和內分泌異常（如糖尿病）有關

正確答案：D. 和內分泌異常（如糖尿病）有關